Clinical trial exclusion criterion:
History of reaction to study antibiotics,

Annotated entities:
- Condition: "reaction"
- Temporal: "History"
- Drug: "study antibiotics"